Patients receiving opioids and other concomitant pain medications should have a stable dose for the last 15 days.

The above is a clinical trial inclusion criterion. Annotated with entity spans:
Patients receiving [Drug: opioids] and [Qualifier: other] concomitant [Drug: pain medications] should have a [Qualifier: stable dose] [Temporal: for the last 15 days].